一位 45 歲婦人因急性上腹疼痛，被送至急診室，發現其腹痛會傳到背後，實驗室檢查發現 Amylase  U/L；Lipase 4860 U/L，對於此婦女的處理，下列敘述何者最適當？
A. 胃鏡對其上腹痛之診斷是必要的
B. 腹部超音波可幫助其診斷
C. 應給予 morphine 止痛
D. 要立刻安排 ERCP 加以診斷兼治療

正確答案：B. 腹部超音波可幫助其診斷